Clinical trial inclusion criteria:
Subjects must be capable of providing signed and dated written informed consent by date of Visit 0 (-2 week).
Male and female aged =19 and < 65 years.
Subjects diagnosed of schizophrenia as defined by Diagnostic and Statistical Manual of Mental Disorders, 4th edition text revision or 5th edition (DSM-<U+2163>-TR or 5) criteria, and a history of illness for at least for 3 years prior to screening.
Subjects who take atypical antipsychotic drugs, and should be maintained on current antipsychotic drugs (including atypical antipsychotic drugs) and dose for at least 4 weeks prior to the screening.
Subjects who need antipsychotic treatment (other than clozapine), and would be stable when switching to long-acting injectable aripiprazole in the investigator's judgement.
Subjects must exhibit willingness, physiologic capability, and an educational level sufficient to comply with all protocol procedures.

Annotated entities:
- Informed_consent: "Subjects must be capable of providing signed and dated written informed consent by date of Visit 0 (-2 week)."
- Person: "Male"
- Person: "female"
- Person: "aged"
- Value: "=19 and < 65 years"
- Condition: "schizophrenia"
- Qualifier: "Diagnostic and Statistical Manual of Mental Disorders, 4th edition text revision or 5th edition (DSM-<U+2163>-TR or 5) criteria"
- Temporal: "history of illness"
- Multiplier: "for at least for 3 years"
- Temporal: "prior to screening"
- Drug: "atypical antipsychotic drugs"
- Non-representable: "and should be maintained on current antipsychotic drugs (including atypical antipsychotic drugs) and dose for at least 4 weeks prior to the screening"
- Non-representable: "Subjects who need antipsychotic treatment (other than clozapine), and would be stable when switching to long-acting injectable aripiprazole in the investigator's judgement."
- Post-eligibility: "Subjects must exhibit willingness, physiologic capability, and an educational level sufficient to comply with all protocol procedures."